De las siguientes variables, cual se considera un marcador de riesgo en la aparición de enfermedad cardiovascular:
1. Cifras elevadas de LDL-colesterol y colesterol total.
2. Hombre mayor de 55 años.
3. Fumador de 20 cigarrillos diarios.
4. Sedentarismo.
5. Todas son correctas.

Respuesta correcta: 2. Hombre mayor de 55 años.